Pregnant/lactating

The above is a clinical trial exclusion criterion. Annotated with entity spans:
[Condition: Pregnant]/[Condition: lactating]